Clinical trial inclusion criteria:
Age 19 years of older
Moderate or severe claudication (Rutherford category 2 or 3)
Critical limb ischemia (Rutherford category 4 or 5)
Patients with signed informed consent
Target lesion length =150 mm by angiographic estimation
Stenosis of more than 50% in femoropopliteal artery
At least one patent (less than 50 percent stenosed) tibioperoneal runoff vessel.

Annotated entities:
- Person: "Age"
- Value: "19 years of older"
- Qualifier: "Moderate"
- Qualifier: "severe"
- Condition: "claudication"
- Measurement: "Rutherford category"
- Value: "2 or 3"
- Qualifier: "Critical"
- Condition: "limb ischemia"
- Measurement: "Rutherford category"
- Value: "4 or 5"
- Non-query-able: "Patients with signed informed consent"
- Condition: "Target lesion"
- Measurement: "length"
- Value: "=150 mm"
- Procedure: "angiographic"
- Condition: "Stenosis"
- Value: "more than 50%"
- Qualifier: "femoropopliteal artery"
- Multiplier: "At least one"
- Condition: "patent tibioperoneal runoff vessel"